Cuando el organismo pasa sucesivamente por las fases de reacción de alarma, fase de resistencia y fase de agotamiento, nos referimos a:
1. El sistema nervioso autónomo.
2. El efecto placebo.
3. El biofeedback electrokinesiológico.
4. La anorexia nerviosa restrictiva.
5. El síndrome general de adaptación.

Respuesta correcta: 5. El síndrome general de adaptación.